Clinical trial exclusion criterion:
Nonspecific immunoglobulin was injected within one month

Annotated entities:
- Drug: "Nonspecific immunoglobulin"
- Temporal: "within one month"